De novo lesion CTO

The above is a clinical trial inclusion criterion. Annotated with entity spans:
[Qualifier: De novo lesion] [Condition: CTO]